Indique qué clase de inmunoglobulina debería solicitarse al laboratorio ante una sospecha de reacción de hipersensibilidad inmediata:
1. Inmunoglobulina A.
2. Inmunoglobulina D.
3. Inmunoglobulina M.
4. Inmunoglobulina E.

Respuesta correcta: 4. Inmunoglobulina E.